Hemoglobin < 10 g/l and/or leucocytes < 4000 cels/mm3 and/or platelets < 150.000 cels/mm3;

The above is a clinical trial exclusion criterion. Annotated with entity spans:
[Measurement: Hemoglobin] [Value: < 10 g/l] and/or [Measurement: leucocytes] [Value: < 4000 cels/mm3] and/or [Measurement: platelets] [Value: < 150.000 cels/mm3];